En relación al trasplante hepático, señale de las siguientes la respuesta CORRECTA:
1. La indicación de trasplante hepático más frecuente en la actualidad es la cirrosis por infección del virus B (VHB).
2. Las metástasis hepáticas por cáncer de colon constituyen una indicación aprobada para trasplante hepático.
3. El sistema MELD es un modelo pronóstico que permite la priorización para el trasplante hepático de los enfermos en lista.
4. El trasplante hepático sería la mejor opción de tratamiento para un paciente de 45 años con un hepatocarcinoma difuso.

Respuesta correcta: 3. El sistema MELD es un modelo pronóstico que permite la priorización para el trasplante hepático de los enfermos en lista.